KPS= 70

The above is a clinical trial inclusion criterion. Annotated with entity spans:
[Measurement: KPS][Value: = 70]